Clinical trial exclusion criteria:
Major depressive disorder with psychotic features
Traumatic Brain Injury (TBI) with a clear impact on activities of daily living
Developmental delay, intellectual deficit, and/or severe educational disability resulting in some dependence for activities of daily living
Ongoing substance use disorder with significant impact on activities of daily living. Difficult or impossible to determine whether cognitive or functional decline is due to substance use or HIV, or both
Evidence of intoxication or withdrawal during the screening evaluation
Central nervous system (CNS) infections or opportunistic conditions: brain abscess (bacterial, mycobacterial, fungal or Toxoplasma), meningitis with persistent neurologic impairment, primary CNS lymphoma, progressive multifocal leukoencephalopathy (PML), or another structural brain lesion with neurological sequelae
Other CNS conditions: non-opportunistic primary or metastatic brain tumors, uncontrolled seizure disorder, progressive multiple sclerosis, stroke with neurological sequelae, or dementia due to causes other than HIV (eg, Alzheimer's disease)
Constitutional illness (eg, persistent unexplained fever, diarrhea, significant weight loss, disabling weakness) within 30 days of screening
Known untreated B12 deficiency or malnutrition (body mass index [BMI] less than 18) at screening
Evidence of current hepatitis C virus infection (HCV) (ie, HCV antibody [Ab] positive within 90 days prior to study entry unless also shown to be plasma HCV RNA negative within the same time period)
Unstable and advanced liver disease (as defined by the presence of at least one of the following: ascites, encephalopathy, coagulopathy, hypoalbuminemia, esophageal or gastric varices, or persistent jaundice)
Prior or current use of any CCR5 antagonist (such as MVC and cenicriviroc [CVC]) and integrase inhibitor (such as RAL, DTG, and elvitegravir [EVG])
Current use of any medication, including antiretrovirals, prohibited in the study (refer to the A5324 protocol-specific web page [PSWP] for the prohibited medications)
Breastfeeding
Presence of an AIDS-defining opportunistic infection within 6 months prior to entry. Note: Refer to the A5324 Manual of Operations (MOPS) for the list of AIDS-defining opportunistic infections.
Active syphilis or treatment for syphilis within 90 days prior to study entry. NOTE: Active syphilis is defined as four-fold increase in serum rapid plasma reagin (RPR) or venereal disease research laboratory (VDRL) tests in an individual with past syphilis, or newly reactive serum RPR or VDRL with a reactive confirmatory test (enzyme immunoassays [EIA] or chemiluminescent assay [CIA], T. pallidum particle agglutination [TP-PA], or fluorescent treponemal antibody absorbed [FTA-ABS]).
Known allergy/sensitivity or any hypersensitivity to components of study drugs or their formulation

Annotated entities:
- Condition: "Major depressive disorder"
- Condition: "Traumatic Brain Injury (TBI)"
- Condition: "impact on activities of daily living"
- Condition: "Developmental delay"
- Condition: "intellectual deficit"
- Condition: "evere educational disability"
- Condition: "dependence for activities of daily living"
- Condition: "substance use disorder"
- Temporal: "Ongoing"
- Condition: "impact on activities of daily living"
- Non-query-able: "Difficult or impossible to determine whether cognitive or functional decline is due to substance use or HIV, or both"
- Condition: "intoxication"
- Condition: "withdrawal"
- Condition: "Central nervous system (CNS) infections"
- Condition: "Central nervous system (CNS) opportunistic conditions"
- Condition: "brain abscess"
- Condition: "meningitis"
- Condition: "neurologic impairment"
- Multiplier: "persistent"
- Qualifier: "bacterial"
- Qualifier: "mycobacterial"
- Qualifier: "fungal"
- Qualifier: "Toxoplasma"
- Condition: "CNS lymphoma"
- Condition: "progressive multifocal leukoencephalopathy (PML)"
- Qualifier: "another"
- Condition: "structural brain lesion"
- Condition: "neurological sequelae"
- Qualifier: "primary"
- Qualifier: "Other"
- Condition: "CNS conditions"
- Qualifier: "non-opportunistic"
- Qualifier: "primary"
- Qualifier: "metastatic"
- Condition: "brain tumors"
- Qualifier: "uncontrolled"
- Condition: "seizure disorder"
- Condition: "progressive multiple sclerosis"
- Condition: "stroke"
- Condition: "neurological sequelae"
- Condition: "dementia"
- Negation: "other than"
- Condition: "HIV"
- Condition: "Alzheimer's disease"
- Condition: "Constitutional illness"
- Condition: "unexplained fever"
- Multiplier: "persistent"
- Condition: "diarrhea"
- Qualifier: "significant"
- Condition: "weight loss"
- Condition: "disabling weakness"
- Temporal: "within 30 days of screening"
- Qualifier: "untreated"
- Condition: "B12 deficiency"
- Condition: "malnutrition"
- Measurement: "body mass index [BMI]"
- Value: "less than 18"
- Temporal: "at screening"
- Temporal: "current"
- Condition: "hepatitis C virus infection (HCV)"
- Measurement: "HCV antibody [Ab]"
- Value: "positive"
- Mood: "Evidence"
- Temporal: "within 90 days prior to study entry"
- Measurement: "plasma HCV RNA"
- Value: "negative"
- Temporal: "within the same time period"
- Qualifier: "Unstable"
- Qualifier: "advanced"
- Condition: "liver disease"
- Multiplier: "at least one"
- Condition: "ascites"
- Condition: "encephalopathy"
- Condition: "coagulopathy"
- Condition: "hypoalbuminemia"
- Condition: "esophageal varices"
- Condition: "gastric varices"
- Qualifier: "persistent"
- Condition: "jaundice"
- Temporal: "Prior"
- Temporal: "current"
- Drug: "CCR5 antagonist"
- Drug: "MVC"
- Drug: "cenicriviroc [CVC]"
- Drug: "integrase inhibitor"
- Drug: "RAL"
- Drug: "DTG"
- Drug: "elvitegravir [EVG]"
- Drug: "medication"
- Drug: "antiretrovirals"
- Qualifier: "prohibited in the study"
- Temporal: "Current"
- Observation: "Breastfeeding"
- Condition: "AIDS-defining opportunistic infection"
- Temporal: "within 6 months prior to entry"
- Temporal: "Active"
- Condition: "syphilis"
- Procedure: "treatment"
- Condition: "syphilis"
- Temporal: "within 90 days prior to study entry"
- Reference_point: "study entry"
- Temporal: "Active"
- Condition: "syphilis"
- Value: "four-fold increase"
- Measurement: "serum rapid plasma reagin (RPR)"
- Measurement: "venereal disease research laboratory (VDRL)"
- Condition: "syphilis"
- Temporal: "past"
- Value: "reactive"
- Temporal: "newly"
- Measurement: "serum RPR"
- Measurement: "VDRL"
- Procedure: "reactive confirmatory test"
- Procedure: "enzyme immunoassays [EIA]"
- Procedure: "chemiluminescent assay [CIA]"
- Procedure: "T. pallidum particle agglutination [TP-PA]"
- Procedure: "fluorescent treponemal antibody absorbed [FTA-ABS]"
- Condition: "allergy"
- Condition: "sensitivity"
- Condition: "hypersensitivity"
- Drug: "components of study drugs"